Diagnosed with Major Depressive Disorder, unipolar or bipolar depression

The above is a clinical trial inclusion criterion. Annotated with entity spans:
Diagnosed with [Condition: Major Depressive Disorder], [Condition: unipolar] or [Condition: bipolar depression]